Clinical trial inclusion criterion:
No significant comorbidities**

Entity relations:
- Has_qualifier("comorbidities", "significant")
- Has_negation("comorbidities", "No")